Clinical trial inclusion criterion:
Planned revascularization of any vessel within 30 days post-index procedure and/or of the target vessel(s) within 12 months post-procedure

Entity relations:
- Has_mood("revascularization", "Planned")
- Has_index("within 30 days post-index procedure", "index procedure")
- Has_index("within 12 months post-procedure", "procedure")
- Has_temporal("of the target vessel(s)", "within 12 months post-procedure")
- Has_temporal("any vessel", "within 30 days post-index procedure")
- Has_qualifier("revascularization", "any vessel")
- OR("any vessel", "of the target vessel(s)")